Subjects must have read and signed the Informed Consent Form prior to study-specific-procedures not part of standard of care

The above is a clinical trial inclusion criterion. Annotated with entity spans:
[Informed_consent: Subjects must have read and signed the Informed Consent Form prior to study-specific-procedures not part of standard of care]